Clinical trial exclusion criterion:
Patients on current anticoagulant therapy

Annotated entities:
- Procedure: "anticoagulant therapy"
- Temporal: "current"